Clinical trial exclusion criterion:
Myelodysplastic syndrome (MDS) or myelofibrosis;

Entity relations:
- OR("Myelodysplastic syndrome (MDS)", "myelofibrosis")